Clinical trial exclusion criteria:
Bacterial infection origin from another organ (e.g. pneumonia)
Severe sepsis with multiorgan failure
Perinephritic abscess
Pyonephrosis requiring drainage
Allergy to pivmecillinam
E.coli isolate resistant to pivmecillinam
Pregnancy/breastfeeding
Severe neutropenia
Prostatitis
Severe kidney failure (eGFR<15 ml/min)
Using valproate

Annotated entities:
- Condition: "Bacterial infection"
- Qualifier: "another organ"
- Condition: "pneumonia"
- Condition: "Severe sepsis"
- Condition: "multiorgan failure"
- Condition: "Perinephritic abscess"
- Condition: "Pyonephrosis"
- Mood: "requiring"
- Procedure: "drainage"
- Condition: "Allergy"
- Drug: "pivmecillinam"
- Drug: "pivmecillinam"
- Condition: "E.coli isolate"
- Qualifier: "resistant to pivmecillinam"
- Condition: "Pregnancy"
- Observation: "breastfeeding"
- Condition: "neutropenia"
- Qualifier: "Severe"
- Condition: "Prostatitis"
- Qualifier: "Severe"
- Condition: "kidney failure"
- Measurement: "eGFR"
- Value: "<15 ml/min"
- Drug: "valproate"